下列何種結石在 non-contrast spiral CT 下仍是 radiolucent？
A. Uric acid stone
B. Xanthine stone
C. Struvite stone
D. Indinavir stone

正確答案：D. Indinavir stone